何種脊髓內腫瘤（intramedullary tumor）最常見？
A. 腦膜瘤（meningioma）
B. 轉移腫瘤（metastatic tumor）
C. 黑色素細胞瘤（melanoma）
D. 星狀細胞瘤（astrocytoma）

正確答案：D. 星狀細胞瘤（astrocytoma）